Clinical trial exclusion criterion:
Pregnant or breast-feeding

Annotated entities:
- Condition: "Pregnant"
- Condition: "breast-feeding"